¿Cómo se explica la gran reactividad de los alcalinos?
1. Porque pierden fácilmente el electrón de la última capa.
2. Porque pierden fácilmente los dos electrones de la última capa.
3. Porque pueden formar compuestos en muchos estados de oxidación.
4. Porque son muy oxidantes.

Respuesta correcta: 1. Porque pierden fácilmente el electrón de la última capa.